El tratamiento consistente en mantener un material a una temperatura elevada durante un periodo de tiempo y posteriormente enfriarlo lentamente recibe el nombre de:
1. Normalizado.
2. Templado.
3. Recocido.
4. Revenido.
5. Sinterizado.

Respuesta correcta: 3. Recocido.